Major psychiatric disorder that is not adequately controlled by treatment

The above is a clinical trial exclusion criterion. Annotated with entity spans:
[Qualifier: Major] [Condition: psychiatric disorder] that is [Negation: not] [Qualifier: adequately controlled] by treatment